Clinical trial exclusion criterion:
BMI > 30;

Annotated entities:
- Measurement: "BMI"
- Value: "> 30"